Clinical trial inclusion criterion:
Body mass index (BMI): 18 ≤ BMI ≤ 32 kg/m²

Annotated entities:
- Measurement: "Body mass index (BMI)"
- Value: "18 ≤ BMI ≤ 32 kg/m²"